children under 3 months of age

The above is a clinical trial exclusion criterion. Annotated with entity spans:
[Person: children] [Value: under 3 months] of [Person: age]